Intends to donate eggs (female participants) or sperm (male participants) while receiving trial medication or within 6 months after trial medication

The above is a clinical trial exclusion criterion. Annotated with entity spans:
Intends to [Procedure: donate eggs] ([Person: female] participants) or sperm ([Person: male] participants) [Temporal: while receiving trial medication] or [Temporal: within 6 months after trial medication]